Have either newly diagnosed metastatic hormone sensitive prostate cancer (mHSPC) or castration-resistant metastatic prostate cancer (mCRPC) and eligible to undergo treatment with abiraterone acetate (mHSPC or mCRPC) or enzalutamide (mCRPC)

The above is a clinical trial inclusion criterion. Annotated with entity spans:
Have either newly diagnosed [Qualifier: metastatic] [Qualifier: hormone sensitive] [Condition: prostate cancer] ([Condition: mHSPC]) or [Qualifier: castration-resistant] [Qualifier: metastatic] [Condition: prostate cancer] ([Condition: mCRPC]) and eligible to undergo [Procedure: treatment] with [Drug: abiraterone acetate] ([Condition: mHSPC] or [Condition: mCRPC]) or [Drug: enzalutamide] ([Condition: mCRPC])